What genes is implicated in myotonic goats and other  nondystrophic myotonias?

The nondystrophic myotonias are rare muscle hyperexcitability disorders caused by gain-of-function mutations in the SCN4A gene or loss-of-function mutations in the CLCN1 gene. In goats, the gCIC-1 protein encoded by the CLCN1 gene, is affected .